良性攝護腺肥大主要由那一區增生引起？
A. 移行區（transitional zone）
B. 周邊區（peripheral zone）
C. 中央區（central zone）
D. 以上各區平均變大增生

正確答案：A. 移行區（transitional zone）